Clinical trial exclusion criterion:
A history of active hemorragge, ulcer, intestinal perforation, intestinal obstruction, or major surgery no older than 30 days;

Entity relations:
- Has_qualifier("hemorragge", "active")
- Has_temporal("hemorragge", "no older than 30 days")
- OR("hemorragge", "intestinal obstruction", "intestinal perforation", "ulcer", "major surgery")